粒線體（mitochondria）之主要功能為：
A. 製造蛋白質
B. 對新合成蛋白質做修補與包裝
C. 分解外來物質
D. 產生能量

正確答案：D. 產生能量